Hemoglobin >9 g/dL (Note: Patients may be transfused or receive erythropoietin to maintain or exceed this level).

The above is a clinical trial inclusion criterion. Annotated with entity spans:
[Measurement: Hemoglobin] [Value: >9 g/dL] [Non-representable: (Note: Patients may be transfused or receive erythropoietin to maintain or exceed this level)].